Clinical trial exclusion criterion:
Allergy to amide local anesthetics (lidocaine, bupivacaine, ropivacaine) or opioid (fentanyl).

Entity relations:
- Subsumes("amide local anesthetics", "lidocaine")
- Subsumes("opioid", "fentanyl")
- AND("Allergy", "amide local anesthetics")
- OR("lidocaine", "bupivacaine", "ropivacaine")
- OR("amide local anesthetics", "opioid")